Clinical trial exclusion criterion:
Antibiotic treatment or routine use of oral antiseptics in the previous 3 months.

Entity relations:
- Has_temporal("oral antiseptics", "in the previous 3 months")
- Has_multiplier("oral antiseptics", "routine use")